Clinical trial inclusion criteria:
(1)= 45 years old;
(2)A diagnosis or previous diagnosis of essential hypertension, including anyone currently taking antihypertensive drugs; or for those who have not taken antihypertensive drugs within the last 2 weeks, two consecutive examinations were conducted at least one day apart, and both sitting blood pressure (mean value of 3 measurements) met the following criteria: diastolic blood pressure (DBP) =90 mmHg or systolic blood pressure (SBP) =140 mmHg (the second blood pressure was measured at V1);
(3)If a study participant is a woman of childbearing age, she agrees to use a reliable contraceptive method during the trial;
(4)Voluntarily participates and has signed an informed consent form.
(1)Completed MTHFR C677T gene polymorphism detection in run-in period or MTHFR C677T genotype already known in advance;
(2)Exhibited good tolerance to enalapril and good overall medication compliance (>80%) in run-in period or previously exhibited good tolerance and adherence to ACEI drugs in previous medication history.
(3)Voluntarily continues to participate in this study.

Annotated entities:
- Value: "= 45 years"
- Person: "old"
- Temporal: "previous"
- Mood: "diagnosis"
- Condition: "essential hypertension"
- Drug: "antihypertensive drugs"
- Drug: "antihypertensive drugs"
- Negation: "not"
- Temporal: "within the last 2 weeks"
- Multiplier: "two consecutive at least one day apart"
- Procedure: "sitting blood pressure"
- Measurement: "diastolic blood pressure (DBP)"
- Value: "=90 mmHg"
- Measurement: "systolic blood pressure (SBP)"
- Value: "=140 mmHg"
- Temporal: "currently"
- Non-representable: "(the second blood pressure was measured at V1)"
- Person: "woman"
- Observation: "childbearing age"
- Qualifier: "reliable"
- Observation: "contraceptive method"
- Temporal: "during the trial"
- Reference_point: "the trial"
- Mood: "agrees to use"
- Observation: "signed an informed consent"
- Observation: "Voluntarily participates"
- Procedure: "gene polymorphism detection"
- Observation: "genotype already known"
- Qualifier: "MTHFR C677T"
- Qualifier: "MTHFR C677T"
- Condition: "good tolerance to enalapril"
- Drug: "enalapril"
- Measurement: "overall medication compliance"
- Value: "good"
- Value: ">80%"
- Temporal: "previously"
- Condition: "good tolerance to ACEI drugs"
- Drug: "ACEI drugs"
- Observation: "good adherence to ACEI drugs"
- Temporal: "medication history"
- Observation: "continues to participate in this study"
- Qualifier: "Voluntarily"